Clinical trial exclusion criterion:
Prior history of hypersensitivity to sildenafil

Annotated entities:
- Condition: "hypersensitivity"
- Drug: "sildenafil"
- Temporal: "Prior history"